Clinical trial inclusion criteria:
Current diagnosis of otolaryngeal cancer and undergoing surgery with general anesthesia
Competent to provide informed consent

Annotated entities:
- Condition: "otolaryngeal cancer"
- Temporal: "undergoing"
- Procedure: "surgery"
- Procedure: "general anesthesia"
- Informed_consent: "Competent to provide informed consent"